Reference vessel diameter 2.75-4.0

The above is a clinical trial inclusion criterion. Annotated with entity spans:
[Measurement: Reference vessel diameter] [Value: 2.75-4.0]